下列有關降血脂藥物對血中 HDL 或 LDL 含量影響之描述何者錯誤？
A. Fibric acid 可減低血中 LDL-C 含量
B. Statins 可減低血中 LDL-C 含量
C. Nicotinic acid 可增加血中 HDL 含量
D. Ezetimibe 可增加血中 HDL 含量

正確答案：D. Ezetimibe 可增加血中 HDL 含量